Clinical trial exclusion criterion:
Current (past 12 months) diagnosis of Panic disorder, Obsessive Compulsive Disorder, Posttraumatic Stress Disorder, Anorexia Nervosa, or Bulimia Nervosa.

Entity relations:
- Has_temporal("Panic disorder", "past 12 months")
- OR("Panic disorder", "Obsessive Compulsive Disorder", "Posttraumatic Stress Disorder", "Anorexia Nervosa", "Bulimia Nervosa")